CrCl = 60 ml/min

The above is a clinical trial inclusion criterion. Annotated with entity spans:
[Measurement: CrCl] [Value: = 60 ml/min]